Clinical trial inclusion criterion:
Participants with low serum testosterone concentrations (< 300 ng/dL) who exhibit at least one sign or symptom of hypogonadism and have evidence of cardiovascular (CV) disease or are at an increased risk for CV disease.

Annotated entities:
- Measurement: "serum testosterone concentrations"
- Value: "low"
- Value: "< 300 ng/dL"
- Multiplier: "at least one"
- Condition: "sign"
- Condition: "symptom"
- Condition: "hypogonadism"
- Mood: "evidence of"
- Condition: "cardiovascular (CV) disease"
- Mood: "increased risk"
- Condition: "CV disease"